Any current psychiatric disorder, other than Alcohol Use Disorder, that, in the judgment of the investigator, will require treatment that will interfere with study participation.

The above is a clinical trial exclusion criterion. Annotated with entity spans:
Any [Temporal: current] [Condition: psychiatric disorder], [Negation: other than] [Condition: Alcohol Use Disorder], [Non-representable: that, in the judgment of the investigator, will require treatment that will interfere with study participation.]